Clinical trial exclusion criterion:
Psychotic depression by DSM-IV, i.e., presence of delusions with a SCID-R score higher than 2;

Annotated entities:
- Condition: "Psychotic depression"
- Qualifier: "DSM-IV"
- Condition: "delusions"
- Measurement: "SCID-R score"
- Value: "higher than 2"